Clinical trial exclusion criterion:
Patient is participating in a conflicting study.

Annotated entities:
- Competing_trial: "Patient is participating in a conflicting study"